Clinical trial inclusion criterion:
Are sensitive to amikacin;

Entity relations:
- AND("sensitive", "amikacin")